Subject with a history of malignancy within the past 5 years (other than squamous or basal cell skin cancer)

The above is a clinical trial exclusion criterion. Annotated with entity spans:
Subject with a [Temporal: history of] [Condition: malignancy] [Temporal: within the past 5 years] ([Negation: other than] [Condition: squamous] or [Condition: basal cell skin cancer])